一位 30 歲婦女於乳房 X 光攝影發現了約 4.5 公分範圍的顯微鈣化點（microcalcification），而針定位乳房切片結果為乳管原位癌（DCIS），Comedo type，則下一步處置何者較合理？
A. 乳房全切除，可考慮立即乳房重建手術
B. 放射線照射
C. 化學治療
D. 門診追蹤即可

正確答案：A. 乳房全切除，可考慮立即乳房重建手術